What is the genetic basis for Cornelia de Lange's syndrome?

Mutations in five genes (NIPBL, SMC1A, SMC3, RAD21, and HDAC8), all regulators or structural components of cohesin, have been identified.